Clinical trial exclusion criterion:
serious diseases

Annotated entities:
- Condition: "diseases"
- Qualifier: "serious"